Patients who have a contraindication to two or more of the three study prophylaxis regimens;

The above is a clinical trial exclusion criterion. Annotated with entity spans:
[Non-representable: Patients who have a contraindication to two or more of the three study prophylaxis regimens];